Los fosfatidilinositoles:
1. Son derivados de los glucocerebrósidos.
2. Actúan como señales intracelulares.
3. Son lípidos lisosomales.
4. Son detergentes biológicos.
5. Contienen taurina o glicina.

Respuesta correcta: 2. Actúan como señales intracelulares.